Documented freedom from AF recurrence (symptomatic or asymptomatic arrhythmic recurrences lasting longer than 30 seconds) 3 months after successful cardiac ablation (AF recurrence during 3-month blanking period is excluded).

The above is a clinical trial inclusion criterion. Annotated with entity spans:
Documented [Negation: freedom] from [Condition: AF recurrence] (symptomatic or asymptomatic [Condition: arrhythmic recurrences] lasting [Value: longer than 30 seconds]) [Temporal: 3 months after successful cardiac ablation] ([Non-query-able: AF recurrence during 3-month blanking period is excluded]).